¿Cuál es la medida más eficaz para la prevención de la enfermedad hemorrágica neonatal?:
1. Realizar el test de Coombs con la sangre del cordón umbilical al nacimiento.
2. Vacunación de la madre con anticuerpos antes del parto.
3. Administración de 1 mg de vitamina K por vía intramuscular al recién nacido.
4. Administración de 1 mg de vitamina K por vía oral y repetir la dosis al cabo de 1 semana.

Respuesta correcta: 3. Administración de 1 mg de vitamina K por vía intramuscular al recién nacido.